一位 30 歲健康男性因車禍嚴重陰囊外傷，而切除兩側睪丸。切除兩側睪丸後，並未予以補充睪酮 （testosterone）。該患者所發生之生理變化，下列何者正確？
A. 身高會變得更高一些
B. 聲音會變得像青春期之前般的童音
C. 陰部毛髮會逐漸變得稀疏
D. 陰莖勃起功能會消失

正確答案：C. 陰部毛髮會逐漸變得稀疏